Patients with 7.0% = HbA1c = 11.0% at the screening visit

The above is a clinical trial inclusion criterion. Annotated with entity spans:
Patients with [Value: 7.0%] = [Measurement: HbA1c] = 11.0% [Temporal: at the screening visit]